王醫師為婦科疾病的權威醫師，他的門診病患中感染何型人類乳突病毒（HPV），會導致罹患子宮頸癌風險大幅提高？
A. Type 9
B. Type 6
C. Type 18
D. Type 11

正確答案：C. Type 18